Clinical trial exclusion criteria:
Contraindications and/or known hypersensitivity to the active substance and/or any of the excipients of epoetin beta treatment
Poorly controlled hypertension as assessed by the investigator
History of Acute Myeloid Leukemia (AML) or high risk for AML
Administration of another investigational drug within 1 month before screening or planned during the study period
Previously documented evidence of Pure Red Cell Aplasia (PRCA)

Annotated entities:
- Condition: "Contraindications"
- Condition: "hypersensitivity"
- Procedure: "epoetin beta treatment"
- Condition: "hypertension"
- Qualifier: "Poorly controlled"
- Condition: "Acute Myeloid Leukemia"
- Condition: "AML"
- Observation: "risk for AML"
- Qualifier: "high"
- Competing_trial: "Administration of another investigational drug within 1 month before screening or planned during the study period"
- Condition: "Pure Red Cell Aplasia"
- Condition: "PRCA"